What disease in Loxapine prominently used for?

The best indication of loxapine is paranoid schizophrenia.